Clinical trial exclusion criterion:
Renal insufficiency with estimated creatinine clearance <30 ml/min/1.73m2

Entity relations:
- Has_value("estimated creatinine clearance", "<30 ml/min/1.73m2")
- AND("Renal insufficiency", "estimated creatinine clearance")